Clinical trial inclusion criterion:
Lipids: one group with an LDL =/>130 and Triglycerides < 150 mg/dL The 2nd group will have and LDL=/>130 mg/dL and Triglycerides =/>150 mg/dL but less than 400 mg/dL.

Annotated entities:
- Measurement: "LDL"
- Value: "=/>130"
- Measurement: "Triglycerides"
- Value: "< 150 mg/dL"
- Non-representable: "The 2nd group will have and LDL=/>130 mg/dL and Triglycerides =/>150 mg/dL but less than 400 mg/dL."
- Non-representable: "one group with"